Clinical trial inclusion criterion:
dimethyl fumarate, or

Annotated entities:
- Drug: "dimethyl fumarate"